Clinical trial exclusion criterion:
Presence of local inflammation and/or infection;

Entity relations:
- OR("local inflammation", "local infection")